陳太太因為長期下背痛前來就診，她有嚴重的骨質疏鬆，且骨盆腔內仍留有金屬製子宮避孕器，則下列那一項物理治療最為合適？
A. 下背熱敷（Hot packing）與腰椎牽引（Pelvic traction）
B. 下背熱敷與干擾波（Interferential current）
C. 下背短波（Shortwave）與腰椎牽引
D. 下背短波與干擾波

正確答案：B. 下背熱敷與干擾波（Interferential current）